輸尿管不由下列何動脈供應？
A. 腎動脈
B. 睪丸或卵巢動脈
C. 腹腔動脈
D. 外腸骨動脈

正確答案：C. 腹腔動脈